Which are the most common methods for circular RNA detection from RNASeq?

The main algorithms are circRNA_finder, find_circ, CIRCexplorer, CIRI, and MapSplice.